Clinical trial inclusion criterion:
ECOG PS: 0,1

Annotated entities:
- Measurement: "ECOG PS"
- Value: "0,1"